Medication: Immunosuppressive drugs, antibiotics in the past three months (before baseline appointment) )

The above is a clinical trial exclusion criterion. Annotated with entity spans:
Medication: [Drug: Immunosuppressive drugs], [Drug: antibiotics] [Temporal: in the past three months] ([Temporal: before baseline appointment]) )